Name two rotavirus vaccines.

Two rotavirus vaccines licensed for global use are RotaTeq and Rotarix.